下列何者為中樞神經性降低交感神經活性藥物，主要用於治療懷孕期間之高血壓？
A. carbidopa
B. dobutamine
C. fenoldopam
D. methyldopa

正確答案：D. methyldopa